La valvulopatía que desencadena una sobrecarga de volumen tanto en la aurícula como en el ventrículo izquierdos es la:
1. Estenosis mitral.
2. Insuficencia mitral.
3. Estenosis aórtica.
4. Insuficencia aórtica.
5. Insuficencia tricúspidea.

Respuesta correcta: 2. Insuficencia mitral.